使用吸入型抗膽鹼藥物（anti-cholinergics）之副作用，下列何者最為少見？
A. 手顫抖
B. 口乾
C. 解小便困難
D. 引起青光眼發作

正確答案：A. 手顫抖